Clinical trial exclusion criterion:
Prior septal surgery

Entity relations:
- Has_temporal("septal surgery", "Prior")